Clinical trial exclusion criterion:
Heart attack within the last six months or progressive coronary artery disease,

Annotated entities:
- Condition: "Heart attack"
- Temporal: "within the last six months"
- Condition: "progressive coronary artery disease"
- Reference_point: "the last six months"